Clinical trial exclusion criterion:
American Society of Anesthesiologists Physical Status IV or V

Annotated entities:
- Measurement: "American Society of Anesthesiologists Physical Status"
- Value: "IV or V"